在黏膜產生的分泌型IgA（secretary IgA）大部分為：
A. 單體（monomer）
B. 二聚體（dimer）
C. 三聚體（trimer）
D. 五聚體（pentamer）

正確答案：B. 二聚體（dimer）